Clinical trial exclusion criterion:
Bone age reading more than 14.0 years

Annotated entities:
- Measurement: "Bone age"
- Value: "more than 14.0 years"